一位 43 歲男性業務員因工作壓力太大，這幾天都解黑便，他的黑便部分原因是因何種物質把血紅素 （hemoglobin）分解成血色素（hematin）？
A. 小腸液
B. 胰腋
C. 膽汁
D. 胃酸

正確答案：D. 胃酸